Clinical trial exclusion criteria:
small bowel resection
right sided hemicolectomy
known chronic diarrheal disease (celiac disease, lactose malabsorption, Inflammatory bowel diseases, incl microscopic colitis)
pregnancy
wish for pregnancy within next three months
allergy to eggs
allergy to constituents in Xenbilox (capsules with chenodeoxycholic acid)
acute cholecystitis within two months
chronic cholecystitis
cirrhosis of the liver
suspected obstructive choledocholithiasis
icterus

Annotated entities:
- Procedure: "small bowel resection"
- Procedure: "right sided hemicolectomy"
- Condition: "chronic diarrheal disease"
- Condition: "celiac disease"
- Condition: "lactose malabsorption"
- Condition: "Inflammatory bowel diseases"
- Condition: "microscopic colitis"
- Condition: "pregnancy"
- Temporal: "within next three months"
- Condition: "pregnancy"
- Mood: "wish for"
- Condition: "allergy"
- Drug: "eggs"
- Condition: "allergy"
- Drug: "constituents in Xenbilox"
- Drug: "chenodeoxycholic acid"
- Condition: "acute cholecystitis"
- Temporal: "within two months"
- Condition: "chronic cholecystitis"
- Condition: "cirrhosis of the liver"
- Mood: "suspected"
- Condition: "obstructive choledocholithiasis"
- Condition: "icterus"